normal full term single pregnancy

The above is a clinical trial inclusion criterion. Annotated with entity spans:
[Qualifier: normal] [Qualifier: full term] [Multiplier: single] [Condition: pregnancy]